下列有關巨噬細胞（macrophages）的敘述，何者正確？
A. 活化後可產生氧反應代謝物（reactive oxygen intermediates）和一氧化氮（NO）
B. 活化後可引發對病原菌具特異性（specific）的毒殺作用
C. 主要是呈現內生性抗原於第二型主要組織相容抗原（MHC class II）造成 T 細胞活化
D. 活化後會產生細胞激素，如 IL-4 等

正確答案：A. 活化後可產生氧反應代謝物（reactive oxygen intermediates）和一氧化氮（NO）